下列那一種類固醇（steroid）的結構是由 19 個碳組成？
A. 助孕素（progesterone）
B. 睪固酮（testosterone）
C. 雌二醇（estradiol）
D. 皮質醇（cortisol）

正確答案：B. 睪固酮（testosterone）